Clinical trial inclusion criterion:
Have diagnosis of prostate cancer and have received treatment with GnRH agonist or antagonist therapy for at least 1 month prior to enrollment.

Entity relations:
- AND("treatment", "GnRH agonist")
- Has_multiplier("treatment", "for at least 1 month")
- Has_temporal("treatment", "prior to enrollment")
- OR("GnRH agonist", "GnRH antagonist")